Clinical trial exclusion criterion:
clinically significant peripheral vascular disease (previous surgery, amputation, or symptoms of claudication)

Annotated entities:
- Qualifier: "clinically significant"
- Condition: "peripheral vascular disease"
- Procedure: "previous surgery"
- Procedure: "amputation"
- Condition: "symptoms of claudication"